兒童橫紋肌肉瘤（rhabdomyosarcoma）的預後，與下列何者無關？
A. 年齡
B. 性別
C. 腫瘤大小
D. 腫瘤位置

正確答案：B. 性別